Clinical trial inclusion criterion:
Women of childbearing potential must have a negative serum pregnancy test within 14 days prior to initiation of treatment and must not be lactating.

Entity relations:
- Has_value("serum pregnancy test", "negative")
- Has_index("within 14 days prior to initiation of treatment", "initiation of treatment")
- Has_negation("lactating", "not")
- Has_temporal("serum pregnancy test", "within 14 days prior to initiation of treatment")
- AND("childbearing potential", "serum pregnancy test")
- AND("Women", "serum pregnancy test")